On chronic hemodialysis not yet on the transplant list and followed in the University's hemodialysis center or in the University's nephrology clinic

The above is a clinical trial inclusion criterion. Annotated with entity spans:
On [Qualifier: chronic] [Procedure: hemodialysis] [Non-query-able: not yet on the transplant list and followed in the University's hemodialysis center or in the University's nephrology clinic]